What is the function of 6SRNA in bacteria?

6S RNA function enhances long-term cell survival.